Gestational age less than 37 completed weeks

The above is a clinical trial exclusion criterion. Annotated with entity spans:
[Measurement: Gestational age] [Value: less than 37 completed weeks]